Clinical trial exclusion criterion:
severe respiratory comorbidities (e.g. chronic obstructive pulmonary disease, pneumonia, respiratory failure)

Annotated entities:
- Condition: "respiratory comorbidities"
- Qualifier: "severe"
- Condition: "chronic obstructive pulmonary disease"
- Condition: "pneumonia"
- Condition: "respiratory failure"